Associated disease which could prevent patient from receiving treatment

The above is a clinical trial exclusion criterion. Annotated with entity spans:
[Undefined_semantics: Associated disease which could prevent patient from receiving treatment]